En lo que se refiere al taponamiento pericárdico, ¿cuál de los siguientes enunciados NO es correcto?
1. La radiografía de tórax resulta muy útil para el diagnóstico.
2. El registro venoso yugular permite objetivar un colapso x muy profundo.
3. Es habitual la presencia de pulso arterial paradójico.
4. El colapso auricular derecho es muy sensible para el diagnóstico.
5. El colapso ventricular derecho es muy específico para el diagnóstico.

Respuesta correcta: 1. La radiografía de tórax resulta muy útil para el diagnóstico.